What is the drug target(s) for Belsomra?

Belsomra is a dual orexin receptor antagonist for both the Ox1 and Ox2 receptors